Clinical trial exclusion criterion:
Are ineligible to take the antiarrhythmic drug to which they would be assigned due to allergy, intolerance or contraindication

Annotated entities:
- Condition: "allergy"
- Condition: "intolerance"
- Condition: "contraindication"
- Drug: "antiarrhythmic drug"